Clinical trial exclusion criterion:
Mild Cognitive Impairment (MCI);

Entity relations:
- Subsumes("Mild Cognitive Impairment", "MCI")